Any disorder of coagulation

The above is a clinical trial exclusion criterion. Annotated with entity spans:
Any [Condition: disorder of coagulation]